Clinical trial exclusion criterion:
Any vaccination 2 weeks prior start of the study

Entity relations:
- Has_index("2 weeks prior start of the study", "start of the study")
- Has_temporal("vaccination", "2 weeks prior start of the study")